Clinical trial exclusion criterion:
Patient not requiring IV morphine (pain score 5/10 or less)

Entity relations:
- Has_value("pain score", "5/10 or less")
- Has_mood("IV morphine", "requiring")
- Has_negation("requiring", "not")
- Subsumes("IV morphine", "pain score")